What percentage of human genes have no introns?

3 percent of the human genome